下列何者最容易產生腎毒性及聽覺損傷的副作用？
A. Ethambutol
B. Isoniazid
C. Rifabutin
D. Amikacin

正確答案：D. Amikacin